Clinical trial exclusion criterion:
Patients with chronic conditions that would limit our ability to develop the study according to objectives, such as neurodevelopmental conditions preventing patients from understanding the Oucher tool

Entity relations:
- Has_context("preventing", "understanding the Oucher tool")
- AND("neurodevelopmental conditions", "preventing")
- Has_context("chronic conditions", "limit our ability to develop the study according to objectives")
- Subsumes("chronic conditions", "neurodevelopmental conditions")